Clinical trial exclusion criteria:
a disease that might affect hepatic or renal function, contraindications to opioid analgesics, fetal growth retardation, signs of fetal asphyxia by cardiotocography, meconium stained amniotic fluid or placental insufficiency. The subjects should not have received fentanyl during the previous 14 days.

Annotated entities:
- Condition: "disease"
- Qualifier: "affect hepatic function"
- Qualifier: "affect renal function"
- Condition: "contraindications"
- Drug: "opioid analgesics"
- Condition: "fetal growth retardation"
- Condition: "fetal asphyxia"
- Mood: "signs of"
- Procedure: "cardiotocography"
- Condition: "meconium stained amniotic fluid"
- Condition: "placental insufficiency"
- Drug: "fentanyl"
- Negation: "not"
- Temporal: "during the previous 14 days"